Has received or is planned to receive toremifene and/or fusidic acid via IV administration within 24 hours before or within 24 hours after administration of study treatment.

The above is a clinical trial exclusion criterion. Annotated with entity spans:
Has received or is [Mood: planned to] receive [Drug: toremifene] and/or [Drug: fusidic acid] via [Qualifier: IV administration] [Temporal: within 24 hours before] or [Temporal: within 24 hours after administration of study treatment].